對於嚴重敗血症所導致的 Hypoperfusion，病人較不會呈現下列何種症狀？
A. 小便減少
B. 心收縮壓＜90 mmHg
C. 代謝性乳酸性血
D. 呼吸速率變慢

正確答案：D. 呼吸速率變慢